20. History of cancer, except Stage 1 cervix or nonmelanotic skin cancer, with the possible exception of patients in complete remission

The above is a clinical trial exclusion criterion. Annotated with entity spans:
20. [Temporal: History] of [Condition: cancer], [Negation: except] [Qualifier: Stage 1 cervix] or [Qualifier: nonmelanotic] [Condition: skin cancer], with the possible exception of patients in complete remission